Imaging evidence of new or presumed new loss of viable myocardium or regional wall motion abnormality.

The above is a clinical trial inclusion criterion. Annotated with entity spans:
[Procedure: Imaging] [Condition: evidence] of [Multiplier: new] or [Multiplier: presumed new] [Condition: loss of viable myocardium] or [Condition: regional wall motion abnormality].